Clinical trial inclusion criterion:
Direct bilirubin < 2.0 x ULN

Entity relations:
- Has_value("Direct bilirubin", "< 2.0 x ULN")